Clinical trial exclusion criteria:
Subjects with any condition that as judged by the Investigator would place the subject at increased risk of harm if he/she participated in the study.
Pregnancy or lactation
Known allergic reaction to tranexamic acid

Annotated entities:
- Non-query-able: "Subjects with any condition that as judged by the Investigator would place the subject at increased risk of harm if he/she participated in the study"
- Pregnancy_considerations: "Pregnancy or lactation"
- Condition: "allergic"
- Drug: "tranexamic acid"